La energía libre estándar de activación de una reacción es:
1. La diferencia de energía libre entre el estado basal de los productos y de los sustratos.
2. La diferencia de la entalpía menos la entropía del sistema.
3. La energía basal de los sustratos en una reacción catalizada.
4. La energía libre adicional que han de alcanzar las moléculas para llegar al estado de transición.
5. La energía liberada de una reacción catalizada.

Respuesta correcta: 4. La energía libre adicional que han de alcanzar las moléculas para llegar al estado de transición.